Hepatic or renal functions abnormal (alanine aminotransferase or aspartate transaminase or total bilirubin > 1.5 upper limit of normal [ULN], or serum creatinine or blood urea nitrogen > 1.5 ULN);

The above is a clinical trial exclusion criterion. Annotated with entity spans:
[Measurement: Hepatic] or [Measurement: renal functions] [Value: abnormal] ([Measurement: alanine aminotransferase] or [Measurement: aspartate transaminase] or [Measurement: total bilirubin] [Value: > 1.5 upper limit of normal [ULN]], or [Measurement: serum creatinine] or [Measurement: blood urea nitrogen] [Value: > 1.5 ULN]);